Clinical trial inclusion criterion:
Patients must have a predicted life expectancy of at least 12 weeks.

Annotated entities:
- Measurement: "predicted life expectancy"
- Value: "at least 12 weeks"